Clinical trial exclusion criterion:
Participants who cannot swallow investigational products

Entity relations:
- AND("cannot swallow", "investigational products")